Clinical trial exclusion criteria:
1. Currently enrolled in another research trial for investigative nutritional or other therapies thought to have an impact on immune system functioning.
2. Unable to consent to the study.
3. Women who are pregnant or are attempting conception, especially in the presence of a history of recurrent spontaneous abortion.
4. Other medical complications that might preclude one from participating in the study, i.e., recent heart attack or stroke or chronic kidney disease.
5. Currently taking immunomodulatory medication, i.e. interferon.
6. Currently taking other medications thought to have an impact on immune system functioning, i.e., chemotherapeutic agents.
7. Known allergy to rice, rice bran, or related food products.
8. Known allergy to mushrooms or related food products.
9. History of malignancies related to the NK cell line, including: NK cell leukemias and T-cell large granular lymphocyte leukemias, NK-cell lymphoproliferative disease of granular lymphocytes, and NK cell lymphomas, e.g., nasal and nasal-like NK/T-cell lymphomas.
10. Current smoker.

Annotated entities:
- Subjective_judgement: "Currently enrolled in another research trial for investigative nutritional or other therapies thought to have an impact on immune system functioning."
- Post-eligibility: "Currently enrolled in another research trial for investigative nutritional or other therapies thought to have an impact on immune system functioning."
- Post-eligibility: "Unable to consent to the study."
- Non-query-able: "Unable to consent to the study."
- Person: "Women"
- Condition: "pregnant"
- Condition: "spontaneous abortion"
- Temporal: "recurrent"
- Condition: "heart attack"
- Temporal: "recent"
- Condition: "stroke"
- Condition: "chronic kidney disease"
- Qualifier: "Other"
- Condition: "medical complications"
- Negation: "preclude"
- Informed_consent: "participating in the study"
- Drug: "immunomodulatory medication"
- Undefined_semantics: "immunomodulatory medication"
- Drug: "interferon"
- Drug: "chemotherapeutic agents"
- Undefined_semantics: "chemotherapeutic agents"
- Temporal: "Currently"
- Qualifier: "other"
- Drug: "medications"
- Qualifier: "impact on immune system functioning"
- Condition: "allergy to rice"
- Drug: "rice"
- Condition: "allergy to rice bran"
- Drug: "rice bran"
- Undefined_semantics: "related food products"
- Condition: "allergy to mushrooms"
- Condition: "allergy to food products"
- Condition: "malignancies"
- Temporal: "History"
- Qualifier: "related to the NK cell line"
- Condition: "NK cell leukemias"
- Condition: "T-cell large granular lymphocyte leukemias"
- Grammar_Error: "and"
- Condition: "NK-cell lymphoproliferative disease of granular lymphocytes"
- Condition: "NK cell lymphomas"
- Condition: "nasal-like NK/T-cell lymphomas"
- Condition: "nasal NK/T-cell lymphomas"
- Grammar_Error: "and"
- Grammar_Error: "and"
- Temporal: "Current"
- Observation: "smoker"